Clinical trial exclusion criterion:
Baseline serology showed a nonreactive RPR test

Entity relations:
- Has_value("RPR test", "nonreactive")
- AND("serology", "RPR test")
- Has_temporal("serology", "Baseline")